Clinical trial inclusion criterion:
Patient with "de novo" heart Failure and LVEF <= 40% admitted in hospital, without contraindications for BB prescription with cardiologist up-titration prescription and without having achieved BB target dose previous discharge and signing informed consent.

Annotated entities:
- Qualifier: "de novo"
- Condition: "heart Failure"
- Measurement: "LVEF"
- Value: "<= 40%"
- Procedure: "admitted"
- Visit: "hospital"
- Negation: "without"
- Condition: "contraindications"
- Drug: "BB"